Clinical trial exclusion criterion:
Indwelling continuous thoracic epidural analgesia

Entity relations:
- Has_qualifier("thoracic epidural analgesia", "continuous")
- Has_qualifier("thoracic epidural analgesia", "Indwelling")